Clinical trial inclusion criterion:
Women who are in their first 5 years of menopause

Annotated entities:
- Person: "Women"
- Temporal: "n their first 5 years of menopause"
- Reference_point: "menopause"
- Condition: "menopause"